Clinical trial inclusion criterion:
2. Be 18 55 years of age.

Entity relations:
- Has_value("age", "18 55 years")